Clinical trial inclusion criterion:
No evidence of recent new inflammatory disease activity (inactive by the Lublin criteria16) with no new relapse for at least five years and no new MRI lesion for at least three years

Annotated entities:
- Condition: "inflammatory disease"
- Measurement: "Lublin criteria"
- Value: "inactive"
- Qualifier: "new"
- Negation: "No"
- Condition: "relapse"
- Qualifier: "new"
- Negation: "no"
- Temporal: "for at least five years"
- Condition: "lesion"
- Procedure: "MRI"
- Temporal: "for at least three years"
- Negation: "no"
- Qualifier: "new"